Clinical trial inclusion criteria:
patients receiving home parenteral nutrition (HPN) because of short bowel syndrome for at least 12 months
stable metabolic status
benign disease

Annotated entities:
- Measurement: "home parenteral nutrition (HPN)"
- Condition: "short bowel syndrome"
- Temporal: "for at least 12 months"
- Measurement: "metabolic status"
- Qualifier: "stable"
- Condition: "benign disease"